一位 54 歲男性因肋膜積水而入院檢查。病患之抽血檢查結果為 LDH（lactate dehydrogenase）＝350 U/L，蛋白質含量＝7.1 g/dL，肋膜積水顯示 LDH＝190 U/L，蛋白質含量＝2.9 g/dL。則下列有關肋膜積水的敘述何者錯誤？
A. 為滲出液（exudate）
B. 為漏出液（transudate）
C. 必須進行細胞學檢驗
D. 必須進行細菌培養

正確答案：A. 為滲出液（exudate）